Clinical trial exclusion criterion:
Severe infectious disease, example (eg) Human Immunodeficiency Virus positive or active tuberculosis.

Entity relations:
- Has_qualifier("infectious disease", "Severe")
- Has_qualifier("tuberculosis", "active")
- Subsumes("infectious disease", "Human Immunodeficiency Virus positive")
- OR("Human Immunodeficiency Virus positive", "tuberculosis")